Clinical trial exclusion criterion:
8. Failure to comply with team's recommendations (e.g. not willing to change pump parameters, follow algorithm's suggestions, etc).

Annotated entities:
- Parsing_Error: "8."
- Non-query-able: "Failure to comply with team's recommendations (e.g. not willing to change pump parameters, follow algorithm's suggestions, etc)."